迴腸憩室（ileal diverticulum）為一殘留之指狀盲囊，其產生的原因為何？
A. 卵黃囊（yolk sac）未退化
B. 尿囊（allantois）未退化
C. 卵黃柄（yolk stalk）退化不全
D. 臍帶閉合不全

正確答案：C. 卵黃柄（yolk stalk）退化不全